下列那一種狀況與羊水栓塞症（amniotic fluid embolism）的發生最無相關？
A. 急產（rapid labor）
B. 羊水胎便染色（meconium-stained amniotic fluid）
C. 子宮靜脈裂傷（tears into uterine veins）
D. 早產（preterm delivery）

正確答案：D. 早產（preterm delivery）